Un clatrato es:
1. Un tipo de interacción covalente.
2. La formación de una red regular del agua alrededor de moléculas no polares.
3. La formación de una red regular del agua alrededor de moléculas polares.
4. La estructura de una red lipídica alrededor de una proteína.
5. Un complejo nucleoproteico.

Respuesta correcta: 2. La formación de una red regular del agua alrededor de moléculas no polares.